Clinical trial exclusion criterion:
Presence of any infertility factor other than anovulation/oligoovulation.

Entity relations:
- Has_negation("anovulation", "other than")
- OR("anovulation", "oligoovulation")